Clinical trial inclusion criterion:
willingness to complete protocol

Annotated entities:
- Informed_consent: "willingness to complete protocol"